What is the relationship between the X chromosome and a  neutrophil drumstick?

In particular, up to 17% of neutrophil nuclei of healthy women exhibit a drumstick-shaped appendage that contains the inactive X chromosome